Electronic or magnetic implants, such as pacemakers

The above is a clinical trial exclusion criterion. Annotated with entity spans:
[Device: Electronic] or [Device: magnetic implants], such as [Device: pacemakers]